¿Cuál de los siguientes síntomas NO está presente en el síndrome de Wallemberg, producido habitualmente por isquemia de la región dorso-lateral del bulbo?
1. Disfonía.
2. Disfagia.
3. Piramidalismo.
4. Ataxia.
5. Síndrome de Horner.

Respuesta correcta: 3. Piramidalismo.